Clinical trial inclusion criterion:
Patients must have a predicted life expectancy of at least 12 weeks.

Entity relations:
- Has_value("predicted life expectancy", "at least 12 weeks")